Clinical trial exclusion criterion:
Renal disease that needs dialysis

Entity relations:
- Has_mood("dialysis", "needs")
- AND("Renal disease", "dialysis")